下列有關葡萄胎（hydatidiform mole）的敘述，何者較不正確？
A. 完全性葡萄胎（complete mole）意指合子的遺傳物質皆為父源
B. 不完全性葡萄胎（partial mole）患者比完全性葡萄胎患者有較高危險性發生絨毛膜癌（choriocarcinoma）
C. 完全性葡萄胎（complete mole）患者比不完全性葡萄胎患者有較高危險性發生侵入性葡萄胎（invasive mole）
D. 不完全性葡萄胎（partial mole）意指合子的遺傳物質為母源加父源

正確答案：B. 不完全性葡萄胎（partial mole）患者比完全性葡萄胎患者有較高危險性發生絨毛膜癌（choriocarcinoma）